Clinical trial exclusion criterion:
Impaired liver function (ALT > 120 U/L)

Annotated entities:
- Condition: "Impaired liver function"
- Measurement: "ALT"
- Value: "> 120 U/L"